Clinical trial inclusion criterion:
Aged < 1 or = 6 years and/or WBC = 20,000/µL

Entity relations:
- Has_value("WBC", "= 20,000/µL")
- Has_value("Aged", "< 1 or = 6 years")
- OR("Aged", "WBC")